patients aged>75 years.

The above is a clinical trial exclusion criterion. Annotated with entity spans:
patients [Person: aged][Value: >75 years].